懷孕29週出生的早產兒，出生體重1600公克，餵食後罹患壞死性腸炎。下列症狀何者最少出現？
A. 便秘
B. 腹脹
C. 嘔吐
D. 血便

正確答案：A. 便秘